Smoker or former smoker.

The above is a clinical trial exclusion criterion. Annotated with entity spans:
[Condition: Smoker] or [Condition: former smoker].